Accident & Emergency Department patients, requiring parenteral drug sedation (as determined by an emergency clinician) will be enrolled.

The above is a clinical trial inclusion criterion. Annotated with entity spans:
[Visit: Accident & Emergency Department] patients, [Mood: requiring] [Procedure: parenteral drug sedation] (as determined by an emergency clinician) will be enrolled.